Clinical trial inclusion criterion:
Considered for a standard immunosuppressive protocol.

Entity relations:
- Has_mood("standard immunosuppressive protocol", "Considered for")